一位 30 歲男性病人於 2007 年夏天自印尼爪哇島返回台灣，於印尼停留期間曾到鄉下地區，且協助處理病死雞隻。返台後就診主訴發燒 3 天，且伴隨有頭痛、全身倦怠、咳嗽，此時下列敘述何者錯誤？
A. 24 小時內通報衛生主管機關
B. 穿戴隔離衣、N95 口罩、手套，進行咽喉拭子採檢，送合約實驗室或衛生主管機關檢驗
C. 將病人轉入負壓隔離病房觀察治療
D. 此時 amantadine 是首選治療

正確答案：D. 此時 amantadine 是首選治療